Clinical trial exclusion criterion:
Emergency operation

Entity relations:
- Has_qualifier("operation", "Emergency")